¿Qué es el estupor catatónico?
1. Una de las respuestas de paralización por el miedo ante situaciones catastróficas o ante la sensación de incapacidad para hacer frente a situaciones estresantes o amenazantes.
2. Perplejidad producida por un sentimiento de angustia, abatimiento, culpa y una sensación de total incapacidad por la decisión.
3. Una respuesta de sobrecogimiento y rigidez por terror, angustia y perplejidad, cuyo origen difícilmente demostrable, ha sido interpretado como debido a “alguna amenaza grave a la conciencia a cerca de sí mismo, obvia para él”.
4. Disminución (e incluso ausencia) de respuestas verbales y motoras a los estímulos.
5. Movimientos musculares en forma de contracciones violentas e incontrolables de la musculatura voluntaria, que se manifiestan en uno o varios grupos musculares o bien de forma generalizada en todo el cuerpo.

Respuesta correcta: 3. Una respuesta de sobrecogimiento y rigidez por terror, angustia y perplejidad, cuyo origen difícilmente demostrable, ha sido interpretado como debido a “alguna amenaza grave a la conciencia a cerca de sí mismo, obvia para él”.